1. Age: 18-75 years old, no limitation in gender;

The above is a clinical trial inclusion criterion. Annotated with entity spans:
1. [Person: Age]: [Value: 18-75 years] old, no limitation in gender;